下列何者可抑制唾液分泌？
A. aspirin
B. atropine
C. cimetidine
D. vasoactive intestinal peptide

正確答案：B. atropine